Clinical trial exclusion criterion:
1. Expected performance of PCI < 60 minutes from diagnosis (qualifying ECG) or inability to arrive at the catheterisation laboratory within 3 hours

Entity relations:
- Has_index("< 60 minutes from diagnosis", "diagnosis")
- Has_temporal("PCI", "< 60 minutes from diagnosis")